¿Cuál de las siguientes características del código genético NO ES CORRECTA?:
1. La secuencia de bases nitrogenadas de un gen determinado posee un marco de lectura fijo y sin signos de puntuación.
2. Está degenerado, pues para muchos aminoácidos existe más de un codón que lo codifica.
3. La degeneración del código genético supone un mecanismo adaptativo que reduce los efectos perjudiciales de las mutaciones.
4. Es totalmente universal, lo que permite la expresión heteróloga de proteínas humanas (por ejemplo insulina) en organismos procariotas como E. coli.
5. Su lectura se hace siempre desde el extremo 5´ fosfato hacia el hidroxilo del ARN mensajero (ARNm).

Respuesta correcta: 4. Es totalmente universal, lo que permite la expresión heteróloga de proteínas humanas (por ejemplo insulina) en organismos procariotas como E. coli.